< 4 seizures/week on average in baseline period

The above is a clinical trial exclusion criterion. Annotated with entity spans:
[Multiplier: < 4] [Condition: seizures]/week on average in baseline period